下列抗結核藥物中，何者對結核桿菌只有抑菌（bacteriostatic），而無殺菌（bactericidal）作用？
A. Isoniazid
B. Rifampin
C. Ethambutol
D. Pyrazinamide

正確答案：C. Ethambutol